Clinical trial exclusion criterion:
Use of any kind of medication under investigation within one year before the vaccination.

Entity relations:
- Has_index("within one year before the vaccination", "the vaccination")
- Has_temporal("medication under investigation", "within one year before the vaccination")